Clinical trial exclusion criterion:
Previous catheter radiofrequency ablation for AF or cardiac surgery;

Annotated entities:
- Procedure: "catheter radiofrequency ablation"
- Condition: "AF"
- Procedure: "cardiac surgery"